Died before TAVI

The above is a clinical trial exclusion criterion. Annotated with entity spans:
[Observation: Died] [Temporal: before TAVI]